Pseudomyxoma peritonei 通常是由何處之腫瘤破裂引起？
A. 胃（stomach）
B. 闌尾或卵巢（appendix or ovary）
C. 空腸（jejunum）
D. 迴腸（ileum）

正確答案：B. 闌尾或卵巢（appendix or ovary）